Patient hospitalized in neuro-critical care for:

The above is a clinical trial inclusion criterion. Annotated with entity spans:
Patient [Visit: hospitalized] in [Visit: neuro-critical care] for: